41 歲男性工人在工地摔跤，X 光顯示在脛骨開放性骨折，經石膏固定後回家休息，晚上睡覺時覺得 右腳越來越痛，他吃了止痛藥後，症狀稍有緩解，但仍然持續疼痛，下列醫療處置何者最正確？
A. 加重止痛藥劑量可使病情改善
B. 換第三代抗生素就可改善
C. 需要把石膏切開
D. 傷口發炎要重新換藥

正確答案：C. 需要把石膏切開